隨著老年人口之增加，失智症（dementia）之患者已越來越多，下列有關失智症之預後及治療之敘述，何者正確？
A. 與較早發作之阿茲海默症相比，較晚發作之阿茲海默症之病程惡化速度較快
B. 腦外傷及心跳停止所引起之失智症，其病程是漸進性地惡化
C. 失智症患者在病發之前的智力及教育程度較高者，其較能補償失智症所引起之智力缺損
D. 對於血管性失智症之血壓控制，通常控制在比正常範圍稍低一些，以免繼續惡化腦血管疾病

正確答案：C. 失智症患者在病發之前的智力及教育程度較高者，其較能補償失智症所引起之智力缺損